La probabilidad de que una persona libre de una enfermedad la desarrolle durante un periodo de tiempo, se corresponde con:
1. Casualidad.
2. Prevalencia.
3. Especificidad.
4. Pronóstico.
5. Riesgo.

Respuesta correcta: 5. Riesgo.